如果錯將 d-tubocurarine 注入新生兒，導致新生兒呼吸抑制，須注射下列何種藥物急救？
A. Atropine
B. Physostigmine
C. Adrenaline
D. Hexamethonium

正確答案：B. Physostigmine